Clinical trial exclusion criterion:
Ruptured membranes

Annotated entities:
- Condition: "Ruptured membranes"